What is the function of the ISW1 and CHD1 remodellers in yeast chromatin?

The ISW1 and CHD1 ATP-dependent chromatin remodelers compete to set nucleosome spacing in vivo In vitro, the three known yeast nucleosome spacing enzymes (CHD1, ISW1 and ISW2) form arrays with different spacing. CHD1 and ISW1 compete to set the spacing on most genes, such that CHD1 dominates genes with shorter spacing and ISW1 dominates genes with longer spacing